History of neurologic disease

The above is a clinical trial exclusion criterion. Annotated with entity spans:
[Temporal: History] of [Condition: neurologic disease]